61 歲的男性，罹患短暫腦缺血（TIA）症狀，頸動脈超音波檢查發現同側頸動脈有 90%以上狹窄，應該做何處理來預防再次發作最有效？
A. 口服 Aspirin
B. 口服 Warfarin
C. 頸動脈內膜剝除術（Carotid endarterectomy）
D. 外頸動脈-內頸動脈繞道術（Extracranial-intracranial bypass）

正確答案：C. 頸動脈內膜剝除術（Carotid endarterectomy）